Clinical trial exclusion criterion:
Current tobacco use.

Annotated entities:
- Observation: "tobacco use"
- Temporal: "Current"